Clinical trial exclusion criterion:
Pre-existing renal or hepatic failure

Entity relations:
- Has_temporal("renal failure", "Pre-existing")
- OR("renal failure", "hepatic failure")